If HBV DNA is positive, the subject is ineligible.

The above is a clinical trial inclusion criterion. Annotated with entity spans:
[Grammar_Error: If HBV DNA is positive, the subject is ineligible].